¿Cuál de las siguientes afirmaciones sobre la insuficiencia renal aguda es FALSA?:
1. Se clasifica en prerenal, intrínseca y postrenal.
2. La insuficiencia renal aguda intrínseca es una patología vascular potencialmente reversible.
3. La insuficiencia renal aguda postrenal es una patología obstructiva, potencialmente reversible.
4. La insuficiencia renal aguda prerenal puede dar lugar a una necrosis tubular aguda.

Respuesta correcta: 2. La insuficiencia renal aguda intrínseca es una patología vascular potencialmente reversible.